What is Creutzfeldt-Jakob Disease (CJD)?

Creutzfeldt-Jakob disease (CJD) is a rare, rapidly progressive, and fatal neurodegenerative disease affecting the central nervous system